Patients with severe cardiac conditions: heart failure (NYHA Class 3 or 4), history of ischemic cardiac disease (unstable angina, myocardial infarction), peripheral vascular diseases, percutaneous transluminal angioplasty or coronary artery bypass graft within recent 6 months.

The above is a clinical trial exclusion criterion. Annotated with entity spans:
Patients with [Qualifier: severe] [Condition: cardiac conditions]: [Condition: heart failure] ([Measurement: NYHA] [Value: Class 3 or 4]), [Temporal: history] of [Condition: ischemic cardiac disease] ([Condition: unstable angina], [Condition: myocardial infarction]), [Condition: peripheral vascular diseases], [Procedure: percutaneous transluminal angioplasty] or [Procedure: coronary artery bypass graft] [Temporal: within recent 6 months].